Clinical trial exclusion criterion:
Babies who have received phenobarbitone or any other anticonvulsive medication before hospitalization

Entity relations:
- multi("hospitalization", "hospitalization")
- Has_index("before hospitalization", "hospitalization")
- Has_qualifier("anticonvulsive medication", "any other")
- Has_temporal("phenobarbitone", "before hospitalization")
- OR("phenobarbitone", "anticonvulsive medication")